Clinical trial exclusion criterion:
Chronic use of vitamin K antagonists or direct thrombin inhibitors, or oral Xa-factor antagonists;

Annotated entities:
- Drug: "vitamin K antagonists"
- Multiplier: "Chronic"
- Drug: "direct thrombin inhibitors"
- Drug: "oral Xa-factor antagonists"